Clinical trial inclusion criterion:
Clinical/ Histological/ cytological/ Imaging examination proven Oral/Oropharynx Squamous-cell carcinoma (Tongue, buccal mucosa, mouth floor, hard palate, Molar area), the depth of invasion > 4mm in preoperative assessment

Annotated entities:
- Condition: "Squamous-cell carcinoma"
- Qualifier: "Oropharynx"
- Qualifier: "Oral"
- Qualifier: "Tongue"
- Qualifier: "buccal mucosa"
- Qualifier: "mouth floor"
- Qualifier: "hard palate"
- Qualifier: "Molar area"
- Measurement: "depth of invasion"
- Value: "> 4mm"
- Procedure: "preoperative assessment"
- Procedure: "Clinical examination"
- Procedure: "Histological examination"
- Procedure: "cytological examination"
- Procedure: "Imaging examination"